El ácido adípico y el 1,6-diaminohexano reaccionan a alta temperatura para formar una poliamida que se conoce como:
1. Celulosa.
2. Almidón.
3. Lana.
4. Nailon 66.

Respuesta correcta: 4. Nailon 66.